hypertension medications taken on morning of surgery (except diuretics)

The above is a clinical trial inclusion criterion. Annotated with entity spans:
[Drug: hypertension medications] taken [Temporal: on morning of surgery] ([Negation: except] [Drug: diuretics])